Clinical trial inclusion criterion:
Age between 18 and 80 years

Annotated entities:
- Person: "Age"
- Value: "between 18 and 80 years"